Clinical trial exclusion criterion:
1. Absence of objectionable cognitive impairment or presence of dementia of severe degree defined by CDR score > 2.0.

Entity relations:
- Has_qualifier("cognitive impairment", "objectionable")
- Has_value("CDR score", "> 2.0")
- AND("dementia", "CDR score")
- Subsumes("CDR score", "severe degree")
- Has_negation("cognitive impairment", "Absence")
- OR("cognitive impairment", "dementia")